Clinical trial inclusion criterion:
= 21 years of age at the time of participation.

Annotated entities:
- Person: "age"
- Value: "= 21 years"
- Temporal: "at the time of participation"
- Reference_point: "participation"